El punto triple de un diagrama de fases de un componente:
1. Presenta 3 grados de libertad, según la regla de las fases.
2. Presenta 1 grado de libertad, según la regla de las fases.
3. Se caracteriza porque las fases líquida y gaseosa son indistinguibles.
4. Se caracteriza porque se encuentran tres fases en equilibrio.
5. Se caracteriza porque se encuentran cuatro fases en equilibrio.

Respuesta correcta: 4. Se caracteriza porque se encuentran tres fases en equilibrio.